Be between age 18 and 55 years

The above is a clinical trial inclusion criterion. Annotated with entity spans:
Be [Value: between] [Person: age] 18 and 55 years